Which graph database is used by the Reactome graph database?

Reactome is a free, open-source, open-data, curated and peer-reviewed knowledgebase of biomolecular pathways. The Neo4j graph database and its query language, Cypher, provide efficient access to the complex Reactome data model, facilitating easy traversal and knowledge discovery.